Ester local anesthetic allergy, PABA allergy

The above is a clinical trial exclusion criterion. Annotated with entity spans:
[Drug: Ester local anesthetic] [Condition: allergy], [Drug: PABA] [Condition: allergy]